Clinical trial exclusion criterion:
History of sensitivity to study medications or any of their excipients

Entity relations:
- AND("sensitivity", "study medications")